Previous pacemaker implantation.

The above is a clinical trial exclusion criterion. Annotated with entity spans:
Previous [Device: pacemaker implantation].